Panel Reactive Antibody (PRA) < 30%.

The above is a clinical trial inclusion criterion. Annotated with entity spans:
[Measurement: Panel Reactive Antibody (PRA)] [Value: < 30%].